下列有關急性胰臟炎（acute pancreatitis）的生化檢查可能出現的變化，何者錯誤？
A. 血清澱粉酶（amylase）及脂肪酶（lipase）上升，大於正常值三倍
B. 血清三酸甘油脂（triglyceride）大於 1000 mg/dL
C. C-反應蛋白（C-reactive protein）上升
D. 脂肪酶上升 2-3 天後下降，澱粉酶上升 7-14 天後下降

正確答案：D. 脂肪酶上升 2-3 天後下降，澱粉酶上升 7-14 天後下降